黃瘤（xanthoma）病灶中，foamy cells細胞質堆積的物質，最可能為：
A. 磷酸鈣
B. 膽固醇
C. Mallory-Denk body
D. 尿酸

正確答案：B. 膽固醇